Which cancer is associated with increased levels of Serum alpha fetoprotein (AFP) ?

Serum alpha fetoprotein (AFP) is a marker of germ cell neoplasms,
Serum α-Fetoprotein (AFP) is a widely used diagnostic biomarker, but it has limited sensitivity and is not elevated in all HCC cases.